ventral hernia repair with mesh

The above is a clinical trial exclusion criterion. Annotated with entity spans:
[Condition: ventral hernia] [Procedure: repair with mesh]